Has received depot antipsychotic medication within one cycle prior to screening.

The above is a clinical trial exclusion criterion. Annotated with entity spans:
Has received [Drug: depot antipsychotic medication] [Temporal: within one cycle prior to screening].